current moderate or severe alcohol/drug use disorder or in the past 8 weeks

The above is a clinical trial exclusion criterion. Annotated with entity spans:
current [Qualifier: moderate] or [Qualifier: severe] [Condition: alcohol]/[Condition: drug use disorder] or [Temporal: in the past 8 weeks]